Clinical trial inclusion criterion:
Diagnosis of MDD (Major Depressive Disorder), made or affirmed by a senior psychiatrist in Shalvata

Annotated entities:
- Condition: "MDD"
- Condition: "Major Depressive Disorder"